下列敘述何者正確？
A. 胞器膜的厚度為 30-40 nm
B. 核糖體大小約 60-80 nm
C. 個別肝醣顆粒大小約 70-100 nm
D. 溶酶體（lysosomes）大小約 0.2-0.5 μm

正確答案：D. 溶酶體（lysosomes）大小約 0.2-0.5 μm